Clinical trial exclusion criterion:
Systemic corticosteroids (oral or injectable) within 7 days of first dose of 852A (topical or inhaled steroids are allowed)

Entity relations:
- Has_temporal("Systemic corticosteroids", "within 7 days of first dose")
- AND("within 7 days of first dose", "852A")
- Has_negation("topical steroids", "are allowed")
- AND("Systemic corticosteroids", "topical steroids")
- Has_qualifier("Systemic corticosteroids", "oral")
- OR("topical steroids", "inhaled steroids")
- OR("oral", "injectable")